Which type of GTPases is required for amino acid-dependent activation of mTORC1?

Amino acids act through the heterodimeric Rag GTPases (RagA or RagB bound to RagC or RagD) in order to promote the translocation of mTORC1 to the lysosomal surface, its site of activation.